Any patients that will be submitted to phacoemulsification surgery in the Hospital de Clinicas of State University of Campinas (BRAZIL)

The above is a clinical trial inclusion criterion. Annotated with entity spans:
Any patients that [Mood: will be submitted to] [Procedure: phacoemulsification surgery] in the [Visit: Hospital de Clinicas of State University of Campinas (BRAZIL)]